La limitación del esfuerzo terapéutico se refiere a:
1. La sedación paliativa.
2. El suicidio asistido.
3. Al rechazo al tratamiento.
4. Al no encarnizamiento terapéutico.
5. A la terapia del doble efecto.

Respuesta correcta: 4. Al no encarnizamiento terapéutico.